Other protocol defined inclusion criteria could apply

The above is a clinical trial inclusion criterion. Annotated with entity spans:
[Non-representable: Other protocol defined inclusion criteria could apply]